Clinical trial exclusion criterion:
Use of smoking cessation medications or interventions in last 30 days

Entity relations:
- AND("medications", "smoking cessation")
- Has_temporal("medications", "in last 30 days")
- OR("medications", "interventions")